Clinical trial exclusion criterion:
Women who are pregnant or nursing

Annotated entities:
- Person: "Women"
- Condition: "pregnant"
- Condition: "nursing"